Clinical trial exclusion criterion:
Hepatitis B or C infection

Entity relations:
- OR("Hepatitis B", "Hepatitis C")